American Society of Anesthesiologists (ASA) I e II;

The above is a clinical trial inclusion criterion. Annotated with entity spans:
[Measurement: American Society of Anesthesiologists (ASA)] [Value: I e II];